Clinical trial inclusion criterion:
The diagnosis of mild-severe acute exacerbation of chronic bronchitis (AECB)

Entity relations:
- Has_qualifier("exacerbation of chronic bronchitis", "acute")
- Has_qualifier("exacerbation of chronic bronchitis", "mild-severe")
- Subsumes("exacerbation of chronic bronchitis", "AECB")